Clinical trial exclusion criterion:
Administration of electrical or chemical cardioversion before screening

Entity relations:
- Has_index("before screening", "screening")
- Has_temporal("electrical cardioversion", "before screening")
- OR("electrical cardioversion", "chemical cardioversion")